Clinical trial exclusion criterion:
Desire/intent to become pregnant over the course of the study

Annotated entities:
- Observation: "Desire/intent to become pregnant"
- Condition: "pregnant"
- Temporal: "over the course of the study"